下列那一種真菌是屬於內源性感染真菌？
A. 念珠菌（Candida）
B. 麴菌（Aspergillus）
C. 表皮癬菌（Epidermophyton）
D. 新型隱球菌（Cryptococcus neoformans）

正確答案：A. 念珠菌（Candida）